下列何者在進食後分泌受到抑制？
A. 膽囊收縮素（cholecystokinin）
B. 胃泌素（gastrin）
C. 運動素（motilin）
D. 胰泌素（secretin）

正確答案：C. 運動素（motilin）